Clinical trial exclusion criterion:
Current participation in transcranial magnetic stimulation studies

Entity relations:
- Has_temporal("transcranial magnetic stimulation studies", "Current")